In sustained clinical remission for the last 6 months while receiving treatment with either etanercept, infliximab, or adalimumab, and greater than or equal to 1 DMARD (methotrexate, hydroxychloroquine, sulfasalazine, leflunomide, minocycline, cyclosporine, azathioprine, gold, penicillamine). DAS28 should be less than 2.6 on each visit over the preceding 6 months, with at least one visit 2-4 months before enrollment. If there is no visit 6 months before enrollment, the nearest visit in the 6-12 month period before enrollment should be considered and have a DAS28 less than 2.6.

The above is a clinical trial inclusion criterion. Annotated with entity spans:
In [Condition: sustained clinical remission] [Multiplier: for the last 6 months] while receiving treatment with either [Drug: etanercept], [Drug: infliximab], or [Drug: adalimumab], and [Multiplier: greater than or equal to 1] [Drug: DMARD] ([Drug: methotrexate], [Drug: hydroxychloroquine], [Drug: sulfasalazine], [Drug: leflunomide], [Drug: minocycline], [Drug: cyclosporine], [Drug: azathioprine], [Drug: gold], [Drug: penicillamine]). [Measurement: DAS28] should be [Value: less than 2.6] [Multiplier: on each visit] [Multiplier: over the preceding 6 months], with [Multiplier: at least one] [Procedure: visit] [Temporal: 2-4 months before enrollment]. [Non-representable: If there is no visit 6 months before enrollment, the nearest visit in the 6-12 month period before enrollment should be considered and have a DAS28 less than 2.6.]